Name scRNA-seq workflows which harness graph attention networks

SCDRHA and CellVGAE